Clinical trial exclusion criterion:
Persons with impaired immune responsiveness (of any cause), including diabetes mellitus and autoimmune disorders

Annotated entities:
- Condition: "impaired immune responsiveness"
- Condition: "diabetes mellitus"
- Condition: "autoimmune disorders"